下列有關自閉症的敘述，何者正確？
A. 其口語表達常有障礙，所以常以肢體語言來和外界進行溝通
B. 大多數有特殊記憶、繪畫、音感的天才能力，所以其治療重點在於尋找病人特別的能力所在
C. 為了有效提升日常生活的能力，必須評估語言、動作、社會關係等層面能力，以制定療育方向
D. 自閉兒具有社會互動、語言發展和粗細動作發展延遲等三項核心特徵

正確答案：C. 為了有效提升日常生活的能力，必須評估語言、動作、社會關係等層面能力，以制定療育方向